關於吞嚥的機制，下列敘述何者錯誤？
A. 口咽期（oral phase）為自主運動，從食物入口至舌根部（tongue base）為止
B. 咽喉期（pharyngeal phase）的第一個動作是顎咽閉鎖（velopharyngeal closure）
C. 食道期（esophageal phase）由環咽部的開啟（cricopharyngeal opening）開始
D. 防止氣管吸入的三個括約肌機制包括：會厭（epiglottis）、假聲帶（false cord）、真聲帶（true

正確答案：A. 口咽期（oral phase）為自主運動，從食物入口至舌根部（tongue base）為止